Current or previous history of analgesic dependence

The above is a clinical trial exclusion criterion. Annotated with entity spans:
[Temporal: Current] or [Temporal: previous] [Temporal: history] of [Condition: analgesic dependence]